Subject's age is between =12 and 16 years, inclusive

The above is a clinical trial inclusion criterion. Annotated with entity spans:
Subject's [Person: age] is [Value: between =12 and 16 years], [Grammar_Error: inclusive]